Which key gene is involved in syndromic obesity phenotype of patients with 1p21.3 microdeletions?

The MIR137 gene. It is the one that is responsible for the obesity phenotype of patients carrying 1p21.3 microdeletions.